Clinical trial inclusion criterion:
3. At least 2 lesions (located in different vessels and in different territories) potentially amenable to stent implantation;

Entity relations:
- Has_value("lesions", "At least 2")
- Has_qualifier("lesions", "located in different vessels")
- AND("potentially amenable", "stent implantation")
- Has_context("lesions", "potentially amenable")
- Has_qualifier("lesions", "located in different territories")